Clinical trial inclusion criterion:
Joint anatomy is identifiable using ultrasonography

Annotated entities:
- Non-representable: "Joint anatomy is identifiable using ultrasonography"